Patients with a current seizure disorder, organic brain disorder or a history of seizure disorders (except for febrile seizures in childhood).

The above is a clinical trial exclusion criterion. Annotated with entity spans:
Patients with a current [Condition: seizure disorder], [Condition: organic brain disorder] or a [Condition: history of seizure disorders] ([Negation: except] for [Condition: febrile seizures] in [Qualifier: childhood]).